Clinical trial exclusion criterion:
Presence of positive test results for hepatitis B virus (HBV), hepatitis B surface antigen (HBsAg), or hepatitis C (HCV) antibody.

Entity relations:
- Has_value("hepatitis B virus (HBV)", "positive")
- Has_value("hepatitis B surface antigen (HBsAg)", "positive")
- Has_value("hepatitis C (HCV) antibody", "positive")